Clinical trial exclusion criterion:
A compromised lung on the contralateral side of the block (Pneumothorax, hemothorax or Pneumonectomy).

Entity relations:
- Has_qualifier("compromised lung", "contralateral side of the block")
- Subsumes("compromised lung", "Pneumothorax")
- OR("Pneumothorax", "hemothorax", "Pneumonectomy")